Soft drusen in treated eye or fellow eye, signs of choroidal neovascularization on ophthalmoscopy and/or FA/ICGA of the study eye.

The above is a clinical trial exclusion criterion. Annotated with entity spans:
[Condition: Soft drusen] in [Qualifier: treated eye] or [Qualifier: fellow eye], signs of [Condition: choroidal neovascularization] on [Procedure: ophthalmoscopy] and/or [Procedure: FA]/[Procedure: ICGA] of the [Qualifier: study eye].